Clinical trial inclusion criterion:
conform to the indications of hepatectomy;

Entity relations:
- multi("indications of hepatectomy", "hepatectomy")